Clinical trial inclusion criteria:
Age 18 to 75 years old (male or female).
Patients with posterior or posterolateral disc herniations at one level between L1 and S1 with radiographic confirmation of neural compression using CT and/or MRI.
At least six (6) weeks of failed, conservative treatment prior to surgery, or requires immediate surgery to prevent permanent disability.
Minimum posterior disc height of 5mm at the index level(s).
Lower back pain and/or sciatica with or without spinal claudication.
Oswestry Questionnaire score of at least 40/100 at baseline.
VAS leg pain of at least 40/100 at baseline.
Psychosocially, mentally and physically able to fully comply with the clinical protocol and willing to adhere to follow-up schedule and requirements.

Annotated entities:
- Person: "Age"
- Value: "18 to 75 years old"
- Person: "male"
- Person: "female"
- Qualifier: "posterolateral"
- Qualifier: "posterior"
- Condition: "disc herniations"
- Qualifier: "one level between L1 and S1"
- Procedure: "radiographic"
- Qualifier: "radiographic confirmation"
- Condition: "neural compression"
- Procedure: "CT"
- Procedure: "MRI"
- Multiplier: "At least six (6) weeks"
- Qualifier: "failed"
- Qualifier: "conservative"
- Procedure: "treatment"
- Temporal: "prior to surgery"
- Procedure: "surgery"
- Condition: "permanent disability"
- Mood: "prevent"
- Qualifier: "immediate"
- Measurement: "posterior disc height"
- Value: "Minimum of 5mm"
- Qualifier: "index level(s)"
- Condition: "Lower back pain"
- Condition: "sciatica"
- Condition: "spinal claudication"
- Measurement: "Oswestry Questionnaire score"
- Value: "at least 40/100"
- Temporal: "at baseline"
- Measurement: "VAS leg pain"
- Value: "at least 40/100"
- Temporal: "at baseline"
- Post-eligibility: "Psychosocially, mentally and physically able to fully comply with the clinical protocol and willing to adhere to follow-up schedule and requirements."